History of three or more consecutively failed In Vitro Fertilization (IVF) cycles after embryo transfer.

The above is a clinical trial inclusion criterion. Annotated with entity spans:
History of [Multiplier: three or more] [Qualifier: consecutively] failed [Procedure: In Vitro Fertilization] ([Procedure: IVF]) cycles [Temporal: after embryo transfer].